Diabetic ketoacidosis

The above is a clinical trial exclusion criterion. Annotated with entity spans:
[Condition: Diabetic ketoacidosis]